Clinical trial inclusion criterion:
4. Subject is an acceptable candidate for elective, urgent or emergency coronary artery bypass graft (CABG).

Entity relations:
- Has_qualifier("coronary artery bypass graft (CABG)", "elective")
- OR("elective", "emergency", "urgent")